3. Women who are pregnant or are attempting conception, especially in the presence of a history of recurrent spontaneous abortion.

The above is a clinical trial exclusion criterion. Annotated with entity spans:
3. [Person: Women] who are [Condition: pregnant] or are attempting conception, especially in the presence of a history of [Temporal: recurrent] [Condition: spontaneous abortion].